有關消化道靜脈回流的敘述，下列何者錯誤？
A. 胃小彎處的靜脈直接回流入肝門靜脈（hepatic portal vein）中
B. 腸繫膜上靜脈（superior mesenteric vein）與脾靜脈（splenic vein）會合形成肝門靜脈（hepatic portal  vein）
C. 腸繫膜下靜脈（inferior mesenteric vein）的血匯入脾靜脈（splenic vein）
D. 胰頭（head of pancreas）的靜脈血先進入脾靜脈（splenic vein）後再匯入肝門靜脈（hepatic portal vein）

正確答案：D. 胰頭（head of pancreas）的靜脈血先進入脾靜脈（splenic vein）後再匯入肝門靜脈（hepatic portal vein）